What is a ciliopathy?

ciliopathies are a group of disorders caused by a defect in ciliogenesis, ciliary protein trafficking.